Clinical trial inclusion criterion:
BCLC stage of 0-B;

Entity relations:
- Has_value("BCLC stage", "0-B")